Respecto al tratamiento de los pacientes con EPOC, señale la respuesta FALSA:
1. El empleo regular de bromuro de ipratropio se ha asociado a una disminución de la mortalidad.
2. En un paciente con saturación arterial de oxígeno inferior al 90% y signos de hipertensión pulmonar debe plantearse el uso de oxígeno suplementario.
3. El uso regular de corticoides inhalados no influye sobre el ritmo de deterioro de la función pulmonar.
4. Los agonistas beta-adrenérgicos de larga duración        proporcionan       beneficios sintomáticos similares a los del bromuro de ipratropio.
5. En los pacientes hospitalizados por exacerbación se ha demostrado que la corticoterapia    acorta   el   tiempo     de hospitalización.

Respuesta correcta: 1. El empleo regular de bromuro de ipratropio se ha asociado a una disminución de la mortalidad.